Clinical trial inclusion criterion:
aged = 6 months

Entity relations:
- Has_value("aged", "= 6 months")